Clinical trial exclusion criterion:
5. Subjects with clinically significant cardiovascular disease. This includes:

Annotated entities:
- Parsing_Error: "5."
- Condition: "cardiovascular disease"
- Qualifier: "clinically significant"
- Subjective_judgement: "clinically significant"
- Undefined_semantics: "clinically significant"
- Parsing_Error: "This includes:"